Se oxida completamente en el ciclo del ácido cítrico:
1. -cetoglutarato.
2. Succinato.
3. Citrato.
4. Acetil-CoA.
5. Oxalacetato.

Respuesta correcta: 4. Acetil-CoA.